Clinical trial inclusion criterion:
Do not take beta-blocker, ACE inhibitor, or nitrate

Entity relations:
- Has_negation("beta-blocker", "Do not")
- OR("beta-blocker", "ACE inhibitor", "nitrate")